8. Left ventricular ejection fraction should be at least 30%.

The above is a clinical trial inclusion criterion. Annotated with entity spans:
8. [Measurement: Left ventricular ejection fraction] should be [Value: at least 30%].